Clinical trial exclusion criteria:
Hemoglobin > 12g/dL
Hematochrit >36%
Thrombocytosis > 750K
AST or ALT > 120
HIV (+)
Allergic reaction upon erythropoietin
Uncontrolled hypertension
mRS before the autoimmune encephalitis > 3
Breast feeding or pregnancy
History of ischemic stroke or pulmonary thrombosis
Refuse to be enrolled

Annotated entities:
- Measurement: "Hemoglobin"
- Value: "> 12g/dL"
- Measurement: "Hematochrit"
- Value: ">36%"
- Measurement: "Thrombocytosis"
- Value: "> 750K"
- Measurement: "AST"
- Measurement: "ALT"
- Value: "> 120"
- Condition: "HIV (+)"
- Condition: "Allergic"
- Drug: "erythropoietin"
- Condition: "Uncontrolled hypertension"
- Condition: "autoimmune encephalitis"
- Temporal: "before the autoimmune encephalitis"
- Reference_point: "the autoimmune encephalitis"
- Measurement: "mRS"
- Value: "> 3"
- Condition: "pregnancy"
- Observation: "Breast feeding"
- Condition: "ischemic stroke"
- Condition: "pulmonary thrombosis"
- Temporal: "History"
- Observation: "Refuse to be enrolled"